臨床上患者呈現「Strawberry tongne」之特徵很可能是感染下列何種疾病？
A. Scarlet fever
B. Streptococcal toxin shock syndrome
C. Staphylococcal toxin shock syndrome
D. Rheumatic fever

正確答案：A. Scarlet fever